Currently dependent on any substance other than cannabis, alcohol or nicotine;

The above is a clinical trial exclusion criterion. Annotated with entity spans:
Currently [Condition: dependent] on any [Drug: substance] [Negation: other than] [Drug: cannabis], [Drug: alcohol] or [Drug: nicotine];